Señale cuál de las siguientes opciones posibilitan las pruebas de evaluación criterial (o con referencia a criterios):
1. Valorar el desempeño respecto de un grupo normativo.
2. Determinar el desempeño relativo entre otras personas.
3. La obtención de una puntuación normativa.
4. Valorar el desempeño respecto de un área de contenido o dominio.
5. Valorar una destreza considerando el desempeño de su grupo de referencia.

Respuesta correcta: 4. Valorar el desempeño respecto de un área de contenido o dominio.